Clinical trial exclusion criterion:
Pregnancy or planning to become pregnant

Entity relations:
- Has_mood("pregnant", "planning to become")
- OR("Pregnancy", "pregnant")